Clinical trial inclusion criterion:
Dutch speaking (Dutch as primary language).

Annotated entities:
- Non-query-able: "Dutch speaking (Dutch as primary language)."